Clinical trial exclusion criterion:
Have used any systemic or topical antibiotics for ocular infection in the previous 14 days.

Annotated entities:
- Drug: "topical antibiotics"
- Qualifier: "topical"
- Drug: "systemic antibiotics"
- Qualifier: "systemic"
- Condition: "ocular infection"
- Temporal: "in the previous 14 days"